White blood cell count, platelet, hematocrit, tuberculosis, aspartate aminotransferase (AST), alanine aminotransferase (ALT), alkaline phosphatase, creatinine, and HIV test results reviewed by transplant center

The above is a clinical trial inclusion criterion. Annotated with entity spans:
[Measurement: White blood cell count], [Measurement: platelet], [Measurement: hematocrit], [Measurement: tuberculosis], [Measurement: aspartate aminotransferase (AST)], [Measurement: alanine aminotransferase (ALT)], [Measurement: alkaline phosphatase], [Measurement: creatinine], and [Measurement: HIV test results] [Qualifier: reviewed by transplant center]